Clinical trial inclusion criterion:
Able to adhere to the study protocol schedule, study restrictions and examination schedule

Annotated entities:
- Post-eligibility: "Able to adhere to the study protocol schedule, study restrictions and examination schedule"